Clinical trial inclusion criterion:
7. Pulse oximetry of > 90% on room air

Annotated entities:
- Parsing_Error: "7."
- Measurement: "Pulse oximetry on room air"
- Value: "> 90%"